Clinical trial exclusion criteria:
Age less than 18 years
American Society of Anesthesiologist Class 5
Projected life expectancy less than 30 days
Known or suspected hypersensitivity to either propofol, e.g. egg or soy allergy, or volatile general anesthetic agents
Known or suspected history of malignant hyperthermia

Annotated entities:
- Person: "Age"
- Value: "less than 18 years"
- Measurement: "American Society of Anesthesiologist Class"
- Value: "5"
- Observation: "Projected life expectancy"
- Value: "less than 30 days"
- Mood: "Known"
- Mood: "suspected"
- Condition: "hypersensitivity"
- Drug: "propofol"
- Drug: "egg"
- Drug: "soy"
- Condition: "allergy"
- Drug: "volatile general anesthetic agents"
- Condition: "malignant hyperthermia"
- Mood: "Known"
- Mood: "suspected"
- Temporal: "history"